List the main protein families found in human tears?

Lipocalin
Cystatin S (CST4), 
calcyclin (S100A6),
calgranulin A (S100A8) 
matrix metalloproteinase 9 (MMP9)
LTF, 
LYZ, 
ZAG,
DNAJC3